一位一個月大嬰兒，接受肛門成形術，麻醉中以呼吸器維持，給予 FiO2＝1，其動脈血氧氣體分析如下：PaCO2＝11 mmHg；pH＝7.47；PaO2＝209 mmHg；計算[HCO3-]＝7.7 mEq/L，Base deficit＝-14.6 mEq/L，則病人屬於那一型酸鹼不平衡？
A. 合併代償性呼吸性酸中毒及代償性代謝性酸中毒
B. 原發性呼吸性鹼中毒及代償性代謝性酸中毒
C. 原發性代謝性酸中毒及代償性呼吸性鹼中毒
D. 合併原發性呼吸性鹼中毒及代謝性酸中毒

正確答案：D. 合併原發性呼吸性鹼中毒及代謝性酸中毒